Clinical trial exclusion criteria:
Known coagulation defect
Patients on longstanding NSAID therapy
Known renal impairment
Patients may also be excluded at the discretion of the investigator

Annotated entities:
- Condition: "coagulation defect"
- Procedure: "NSAID therapy"
- Temporal: "longstanding"
- Condition: "renal impairment"
- Non-query-able: "Patients may also be excluded at the discretion of the investigator"